1. Justification: Many neural processes change with age, and these changes could introduce unwanted variability in both behavioral and MRI signals. In addition, the risk of difficult-to-detect medical abnormalities such as silent cerebral infarcts increases with age.

The above is a clinical trial inclusion criterion. Annotated with entity spans:
[Parsing_Error: 1.] [Parsing_Error: Justification: Many neural processes change with age, and these changes could introduce unwanted variability in both behavioral and MRI signals.] [Not_a_criteria: In addition, the risk of difficult-to-detect medical abnormalities such as silent cerebral infarcts increases with age.]